Clinical trial inclusion criterion:
infertility,

Annotated entities:
- Condition: "infertility"